目前最適合使用於骨髓移植之病人，又名 sargramostim 的群落刺激因子（colony-stimulating factor， CSF）為下列那一種？
A. G-CSF
B. GM-CSF
C. Multi-CSF
D. M-CSF

正確答案：B. GM-CSF